Clinical trial exclusion criterion:
19. Use of a platelet-derived growth factor within 28 days before screening

Entity relations:
- Has_index("within 28 days before screening", "screening")
- Has_temporal("platelet-derived growth factor", "within 28 days before screening")